Patient is currently benefiting from the treatment with ruxolitinib, as determined by the investigator

The above is a clinical trial inclusion criterion. Annotated with entity spans:
[Non-query-able: Patient is currently benefiting from the treatment with ruxolitinib, as determined by the investigator]